La oxidación de ácidos grasos en células de plantas superiores tiene lugar en:
1. Retículo endoplasmático.
2. Cloroplastos.
3. Peroxisomas.
4. Citosol.
5. Mitocondrias.

Respuesta correcta: 3. Peroxisomas.